Which models are used for predicting disease progression in Duchenne Muscular Dystrophy?

Modeling disease trajectory in Duchenne muscular dystrophy Longitudinal changes in biomarkers were modeled with a cumulative distribution function using a nonlinear mixed-effects approach.